HIV positive

The above is a clinical trial exclusion criterion. Annotated with entity spans:
[Measurement: HIV] [Value: positive]